El límite de endotoxinas bacterianas establecido por la Farmacopea Europea para el agua para inyección es:
1. 0,25 UI / ml.
2. 0,10 UI / ml.
3. 0 UI / ml.
4. 0,22 UI / ml.
5. 0,15 UI / ml.

Respuesta correcta: 1. 0,25 UI / ml.